一位 20 歲男性病人，因為第二性徵不明顯而來求診。他的身高 178 公分，體重 70 公斤，沒有鬍子、腋毛及陰毛稀少、睪丸小而硬。此病人經下列各項檢查，那一種結果最有可能？
A. FSH 值偏低
B. Testosterone 仍在正常範圍
C. 染色體檢查不正常
D. 嗅覺異常

正確答案：C. 染色體檢查不正常